鬆弛的（relaxed）骨骼肌肌節內，那個區域不含粗肌絲（thick filaments）？
A. I 帶
B. A 帶
C. H 帶
D. M 線

正確答案：A. I 帶